¿Qué afirmación es cierta en relación al término transcriptoma?:
1. Incluye todo el ARN de transferencia generado a partir del genoma de un organismo.
2. Incluye todo el ARN mensajero que se genera a partir del genoma de un organismo.
3. Incluye los productos traducidos a partir del genoma de un organismo.
4. Incluye todo tipo de ARN generado a partir del genoma de un organismo.

Respuesta correcta: 2. Incluye todo el ARN mensajero que se genera a partir del genoma de un organismo.